¿Cuál de las siguientes afirmaciones respecto al Trastorno Bipolar II es cierta?
1. La característica esencial es un curso clínico caracterizado por uno o más episodios maníacos o episodios mixtos.
2. La presencia de un episodio maníaco o mixto impide que se realice el diagnóstico.
3. Los episodios de trastorno del estado de ánimo inducido por sustancias o debidos a enfermedad médica se consideran válidos para establecer el diagnóstico de trastorno bipolar II.
4. La información que nos ofrecen otras personas no ayuda mucho a establecer el diagnóstico.
5. El trastorno bipolar II se caracteriza por la aparición de uno o más episodios depresivos mayores acompañados por al menos un episodio maníaco.

Respuesta correcta: 2. La presencia de un episodio maníaco o mixto impide que se realice el diagnóstico.